Clinical trial exclusion criterion:
History of seizures

Annotated entities:
- Condition: "seizures"
- Temporal: "History of"